La autora que mostró en sus escritos su interés por el control del medio ambiente, así como la importancia de la influencia de la Naturaleza en la salud de las personas es:
1. V. Henderson.
2. H. Peplau.
3. F. Nightingale.
4. M. Leininger.
5. D. Orem.

Respuesta correcta: 3. F. Nightingale.